Children with any basal condition (trauma, infection, minor accidents, etc..) will be able to participate in the study provided they and their family are willing and do not meet the above-mentioned exclusion criteria.

The above is a clinical trial exclusion criterion. Annotated with entity spans:
Children with any [Condition: basal condition] ([Condition: trauma], [Condition: infection], [Condition: minor accidents], etc..) will be able to participate in the study provided they and their family are willing and do not meet the above-mentioned exclusion criteria.